Calculated eGFR below 60ml/min/1.73m2 (MDRD)

The above is a clinical trial inclusion criterion. Annotated with entity spans:
[Measurement: Calculated eGFR] [Value: below 60ml/min/1.73m2] (MDRD)